35歲女性乳癌，接受乳房改良性根除性乳房切除術（modified radical mastectomy）後的病理報告為T1N2M0女性荷爾蒙接受器（estrogen receptor，ER） 陰性，黃體素荷爾蒙接受器（progesterone receptor，PR）陰性，HER-2/neu陽性，下列何者是最適合的治療？
A. 不需治療
B. 只需要放射線治療
C. 只需要標靶治療
D. 化學治療，標靶治療、放射線治療全部均需要

正確答案：D. 化學治療，標靶治療、放射線治療全部均需要